Clinical trial exclusion criterion:
Has known intolerance or documented adverse reaction to acetaminophen or naproxen or celecoxib

Entity relations:
- AND("intolerance", "acetaminophen")
- OR("acetaminophen", "celecoxib", "naproxen")
- OR("intolerance", "adverse reaction")